currently using medications containing lidocaine

The above is a clinical trial exclusion criterion. Annotated with entity spans:
[Temporal: currently] using [Drug: medications containing lidocaine]